Echocardiographic evidence of intracardiac mass, thrombus or vegetation.

The above is a clinical trial exclusion criterion. Annotated with entity spans:
[Procedure: Echocardiographic] evidence of [Condition: intracardiac mass], thrombus or vegetation.